De las indicaciones reseñadas, ¿cuál de ellas está autorizada para los IECA?
1. Angioedema.
2. Hipertensión pulmonar en neonatos.
3. Nefropatía diabética.
4. Hiperplasia benigna de próstata.
5. Glaucoma de ángulo estrecho.

Respuesta correcta: 3. Nefropatía diabética.